下列有關細胞激素（cytokine）的敘述，何者錯誤？
A. 所有的細胞激素都是蛋白質，有些則為醣蛋白
B. 細胞與細胞之間溝通的橋樑，有時一個細胞激素（cytokine）可作用二個以上的細胞
C. 每一個細胞激素（cytokine）要作用於該細胞，則該細胞表面須有接受器
D. 細胞激素 IL-4 為 B 淋巴細胞所分泌，可刺激漿細胞分泌大量抗體

正確答案：D. 細胞激素 IL-4 為 B 淋巴細胞所分泌，可刺激漿細胞分泌大量抗體